有關骨生成（bone-forming）腫瘤之敘述，下列何者最正確？
A. 診斷骨肉瘤（osteosarcoma）時，有部分病患同時會被診斷出肺轉移
B. 骨軟骨瘤（osteochondroma）因有惡性變化的可能，故均須接受手術切除
C. 骨母細胞瘤（osteoblastoma）引起的疼痛可藉藥物緩解，因此不須手術
D. 骨樣骨瘤（osteoid osteoma）好發於關節及長骨骨骺（epiphysis）

正確答案：A. 診斷骨肉瘤（osteosarcoma）時，有部分病患同時會被診斷出肺轉移